People with any open or bleeding wounds at any sensor plate contact surface location

The above is a clinical trial exclusion criterion. Annotated with entity spans:
People with any [Condition: open] or [Condition: bleeding wounds] [Qualifier: at any sensor plate contact surface location]